位於小腸上皮細胞之紋狀緣（striated border），是由下列何種構造組成？
A. 鞭毛（flagella）
B. 纖毛（cilia）
C. 靜纖毛（stereocilia）
D. 微絨毛（microvilli）

正確答案：D. 微絨毛（microvilli）